En el colágeno, ¿cuál es el aminoácido que se repite siempre cada tres residuos?:
1. Prolina.
2. Hidroxiprolina.
3. Glicina.
4. Alanina.

Respuesta correcta: 3. Glicina.